60 歲健康停經白人婦女考慮服用荷爾蒙補充療法（HT）0.625 mg Premarin（CEE）加 2.5 mg medroxyprogesterone（MPA）5 年，來預防骨質疏鬆，下列那項對她而言風險最高？
A. 冠狀動脈疾病
B. 乳癌
C. 大腸癌
D. 靜脈栓塞

正確答案：D. 靜脈栓塞